Clinical trial exclusion criterion:
13. Clinically relevant liver function impairment.

Annotated entities:
- Parsing_Error: "13."
- Condition: "liver function impairment"
- Subjective_judgement: "Clinically relevant"
- Undefined_semantics: "Clinically relevant"
- Qualifier: "Clinically relevant"